下列那一項臨床檢	項目，是常規做為評估以高效能雞尾酒治療愛滋病（AIDS）效果的主要指標？
A. p24抗原（antigen）之測定
B. CD4:CD8 T-cell比例之測定
C. 血漿中人類免疫缺陷病毒（HIV）病毒量之測定
D. HIV抗原/抗體（antigen/antibody）組合測試（combo test）

正確答案：C. 血漿中人類免疫缺陷病毒（HIV）病毒量之測定